Patients receiving once daily dosing of methylprednisolone or prednisone in a dose of 10 mg/day or greater

The above is a clinical trial inclusion criterion. Annotated with entity spans:
Patients receiving [Multiplier: once daily] dosing of [Drug: methylprednisolone] or [Drug: prednisone] in a dose of [Multiplier: 10 mg/day or greater]